Clinical trial exclusion criterion:
oocyte donation cycles

Annotated entities:
- Procedure: "oocyte donation cycles"